在正常月經週期排卵後，若未受孕，其黃體可存活大約幾日？
A. 1
B. 5
C. 14
D. 28

正確答案：C. 14